在因果相關中，因一定要出現在果之前，也就是說致病因子應該在疾病發生之前，侵襲到研究對象，而且從受侵襲到發病之間的時間間隔，必須要較疾病的誘導期或潛伏期長。上列敘述屬於判斷因果關係的那一個條件？
A. 生物贊同性
B. 相關的一致性
C. 相關的強度
D. 相關的時序性

正確答案：D. 相關的時序性